下列何者是女性假性陰陽人（female pseudohermaphroditism）最常見的原因？
A. 先天腎上腺增生（congenital adrenal hyperplasia）
B. 母親懷孕時服用男性荷爾蒙
C. Klinefelter's syndrome
D. Turner's syndrome

正確答案：A. 先天腎上腺增生（congenital adrenal hyperplasia）